上頜竇的開口（opening of maxillary sinus）位於鼻腔側壁何處？
A. 篩泡（ethmoidal bulla）
B. 半月裂（semilunar hiatus）
C. 下鼻道（inferior nasal meatus）
D. 上鼻道（superior nasal meatus）

正確答案：B. 半月裂（semilunar hiatus）